下列腎絲球疾病中，何者 易產生新月形（crescent）腎絲球細胞增生？
A. 細基底膜病（thin basement membrane disease）
B. 抗基底膜病（anti-basement membrane disease）
C. 瀰漫性膜性腎絲球腎炎（diffuse membranous glomerulonephritis）
D. 糖尿病腎絲球疾病（diabetic glomerular disease）

正確答案：B. 抗基底膜病（anti-basement membrane disease）